下列何種藥物給予腎臟功能不全與缺乏 G-6-P dehydrogenase 的病人會造成神經病變及溶血症？
A. Salicylic acid
B. Nitrofurantoin
C. Metronidazole
D. Methenamine

正確答案：B. Nitrofurantoin